Clinical trial inclusion criteria:
Inpatient or outpatient age 8-19 years inclusive; participants must live with a parent, guardian, or caregiver;
Fluent in English;
Diagnosed or told by a clinician that they have any of the following bipolar spectrum disorders (BSD): bipolar I, bipolar II, unspecified bipolar and related disorders, Disruptive Mood Dysregulation Disorder (DMDD), cyclothymic disorder, other specified bipolar and related disorders, as well as mood disorder not otherwise specified (if diagnosed in the past as per DSM-IV);
Body mass index >85%ile for age and sex by standard growth charts;
Received a new or ongoing prescription for at least one SGA (i.e., olanzapine, clozapine, risperidone, quetiapine, aripiprazole, ziprasidone, iloperidone, lurasidone, paliperidone, brexpiprazole or cariprazine) that is not prescribed as a PRN medication;

Annotated entities:
- Person: "Inpatient"
- Person: "outpatient"
- Person: "age"
- Value: "8-19 years"
- Non-query-able: "participants must live with a parent, guardian, or caregiver"
- Non-query-able: "Fluent in English;"
- Condition: "bipolar spectrum disorders"
- Condition: "BSD"
- Condition: "bipolar I"
- Condition: "bipolar II"
- Condition: "unspecified bipolar and related disorders"
- Condition: "Disruptive Mood Dysregulation Disorder"
- Condition: "DMDD"
- Condition: "cyclothymic disorder"
- Condition: "other specified bipolar and related disorders"
- Condition: "mood disorder not otherwise specified"
- Measurement: "Body mass index"
- Value: ">85%ile"
- Multiplier: "at least one"
- Drug: "SGA"
- Drug: "olanzapine"
- Drug: "clozapine"
- Drug: "risperidone"
- Drug: "quetiapine"
- Drug: "aripiprazole"
- Drug: "ziprasidone"
- Drug: "iloperidone"
- Drug: "lurasidone"
- Drug: "paliperidone"
- Drug: "brexpiprazole"
- Drug: "cariprazine"